Clinical trial inclusion criteria:
age =18 at screening
not intending to move away from the clinic's catchment area for the next 2 years
HIV-1 antibody negative
reports commercial sex work
contact information is provided
written informed consent

Annotated entities:
- Person: "age"
- Value: "=18"
- Non-query-able: "not intending to move away from the clinic's catchment area for the next 2 years"
- Measurement: "HIV-1 antibody"
- Value: "negative"
- Observation: "commercial sex work"
- Post-eligibility: "contact information is provided"
- Informed_consent: "written informed consent"